Clinical trial inclusion criteria:
Patient diagnosed by HRCT Core Lab with eligible heterogeneous disease distribution and at least one complete oblique fissure.
Age from 40 to 75 years
BMI < 32 kg/m2
FEV1 < 40% of predicted value, FEV1/FVC < 70%
TLC > 120% predicted, RV > 150% predicted.
Stable with < 20 mg prednisone (or equivalent) qd
PaCO2 < 50mm Hg
PaO2 > 45 mm Hg on room air
6-min walk of > 50m (without rehabilitation) or > 100m (with rehabilitation)
Nonsmoking for 4 months prior to initial interview and throughout screening
The patient agrees to all protocol required follow-up intervals.
The patient has no child bearing potential
The patient is willing and able to complete protocol required baseline assessments and procedures

Annotated entities:
- Procedure: "HRCT Core Lab"
- Condition: "heterogeneous disease distribution"
- Multiplier: "at least one"
- Condition: "complete oblique fissure"
- Person: "Age"
- Value: "from 40 to 75 years"
- Measurement: "BMI"
- Value: "< 32 kg/m2"
- Measurement: "FEV1"
- Value: "< 40% of predicted value"
- Measurement: "FEV1/FVC"
- Value: "< 70%"
- Measurement: "TLC"
- Value: "> 120% predicted"
- Measurement: "RV"
- Value: "> 150% predicted"
- Multiplier: "< 20 mg qd"
- Drug: "prednisone"
- Condition: "Stable"
- Measurement: "PaCO2"
- Value: "< 50mm Hg"
- Measurement: "PaO2"
- Value: "> 45 mm Hg"
- Qualifier: "on room air"
- Measurement: "6-min walk"
- Value: "> 50m"
- Value: "> 100m"
- Negation: "without"
- Qualifier: "rehabilitation"
- Qualifier: "rehabilitation"
- Condition: "Nonsmoking"
- Temporal: "for 4 months prior to initial interview"
- Reference_point: "initial interview"
- Temporal: "throughout screening"
- Reference_point: "screening"
- Observation: "agrees to all protocol required follow-up intervals"
- Visit: "follow-up intervals"
- Condition: "child bearing potential"
- Negation: "no"
- Observation: "willing and able to complete protocol"
- Procedure: "baseline assessments"
- Procedure: "baseline procedures"